Age between 20 and 80 years

The above is a clinical trial inclusion criterion. Annotated with entity spans:
[Person: Age] [Value: between 20 and 80 years]